Patient and designee capable of giving fully informed consent in writing

The above is a clinical trial inclusion criterion. Annotated with entity spans:
[Post-eligibility: Patient and designee capable of giving fully informed consent in writing]